Clinical trial inclusion criterion:
Adult patients (= 18 years)

Annotated entities:
- Person: "Adult"
- Person: "years"
- Value: "= 18"